下列那一種疫苗可以預防胎兒發生先天性感染（congenital infection）？
A. 麻疹疫苗（Measles vaccine）
B. 腮腺炎疫苗（Mumps vaccine）
C. 德國麻疹疫苗（Rubella vaccine）
D. 小兒麻痺症疫苗（Polio vaccine）

正確答案：C. 德國麻疹疫苗（Rubella vaccine）